Clinical trial exclusion criterion:
Coronary artery disease - stent

Annotated entities:
- Condition: "Coronary artery disease"
- Device: "stent"